葉教授的實驗室進行結核菌研究，所以實驗室的學生都需進行結核菌素測驗。一位暑期研究同學在測驗後 50 小時產生陽性反應。如果對這位同學進行皮膚切片觀察其中的反應，最可能會看到的結果為何？
A. 皮膚水腫，無白血球聚集
B. T 細胞及巨噬細胞聚集
C. B 細胞及漿細胞聚集
D. 嗜伊紅性白血球及肥大細胞聚集

正確答案：B. T 細胞及巨噬細胞聚集